Please list 7 classes of drugs that interact with Warfarin.

The number of drugs reported to interact with warfarin continues to expand. There are reports of interactions with azole antibiotics, macrolides, quinolones, nonsteroidal anti-inflammatory drugs, including selective cyclooxygenase-2 inhibitors, selective serotonin reuptake inhibitors, omeprazole, lipid-lowering agents, protease inhibitors, amiodarone, fluorouracil, psychotropics, and oral corticosteroids.